Clinical trial inclusion criterion:
Failed at least one antiarrhythmic drug (AAD) (Class I or III antiarrhythmic drugs) as evidenced by recurrent symptomatic AF, or intolerable to the AAD

Annotated entities:
- Multiplier: "at least one"
- Drug: "antiarrhythmic drug (AAD)"
- Drug: "III antiarrhythmic drugs"
- Drug: "Class I antiarrhythmic drugs"
- Condition: "recurrent symptomatic AF"
- Condition: "intolerable"
- Condition: "AAD"